Clinical trial exclusion criterion:
Emergency surgery

Annotated entities:
- Procedure: "Emergency surgery"